Clinical trial exclusion criterion:
History or other evidence of severe illness or any other conditions which would make the patient, in the opinion of the investigator, unsuitable for the study.

Annotated entities:
- Post-eligibility: "History or other evidence of severe illness or any other conditions which would make the patient, in the opinion of the investigator, unsuitable for the study."